What is marked by DNaseI hypersensitive sites?

The identification of cis-regulatory elements is central to understanding gene transcription. Hypersensitivity of cis-regulatory elements to digestion with DNaseI remains the gold-standard approach to locating such elements in regions of open chromatin.